Clinical trial inclusion criterion:
Normal cognitive function in order to sign written, informed consent and to understand trial protocol

Annotated entities:
- Post-eligibility: "ormal cognitive function in order to sign written, informed consent and to understand trial protoco"